What happens upon disruption of a TAD boundary?

rewiring occurred only if the variant disrupted a ctcf-associated boundary domain . of a tad boundary causes ectopic chromosomal contacts and long-range transcriptional misregulation. . of topological chromatin domains cause pathogenic rewiring of gene-enhancer interactions .